Clinical trial exclusion criteria:
abnormal renal function
currently pregnant, or trying to become pregnant
being treated with a beta-blocker
use of illicit drugs

Annotated entities:
- Condition: "abnormal renal function"
- Temporal: "currently"
- Condition: "pregnant"
- Mood: "trying to become"
- Condition: "pregnant"
- Drug: "beta-blocker"
- Procedure: "treated"
- Drug: "illicit drugs"